Bleeding from gastric varices, with or without esophageal varices

The above is a clinical trial exclusion criterion. Annotated with entity spans:
[Condition: Bleeding] from [Condition: gastric varices], with or without [Condition: esophageal varices]